end diastolic diameter >60 mm and/or an ejection fraction <50%

The above is a clinical trial inclusion criterion. Annotated with entity spans:
[Measurement: end diastolic diameter] [Value: >60 mm] and/or an [Measurement: ejection fraction] [Value: <50%]